Señale la respuesta INCORRECTA respecto al edema angioneurótico hereditario de tipo I.
1. Se hereda siguiendo un patrón de herencia autosómico recesivo.
2. Se debe a una deficiencia cuantitativa de la proteína C1-inhibidor.
3. Se caracteriza por brotes repetitivos y autolimitados de angioedema, que pueden poner en riesgo la vida del paciente.
4. Es el déficit hereditario de complemento más frecuente.

Respuesta correcta: 1. Se hereda siguiendo un patrón de herencia autosómico recesivo.